Taking other drugs which can influence the lipid profile (eg. Niacin, Fibrates;

The above is a clinical trial exclusion criterion. Annotated with entity spans:
Taking [Qualifier: other] [Drug: drugs] which [Qualifier: can influence the lipid profile] (eg. [Drug: Niacin], [Drug: Fibrates];